Clinical trial exclusion criterion:
History of three or more miscarriages

Annotated entities:
- Multiplier: "three or more"
- Condition: "miscarriages"